El esqueleto carbonado de la prolina entra en el ciclo del ácido cítrico en forma de:
1. Fumarato.
2. Isocitrato.
3. α-cetuglutarato.
4. Oxalacetato.
5. Succinato.

Respuesta correcta: 3. α-cetuglutarato.